有關 nicotinic cholinoceptor 之敘述，下列何者錯誤？
A. 是一種 G 蛋白耦合之受體
B. 可被乙醯膽鹼活化
C. 位於交感神經節節後神經細胞體上
D. 活化後可使骨骼肌收縮

正確答案：A. 是一種 G 蛋白耦合之受體